Clinical trial exclusion criterion:
History of malignant tumor or life expectancy under 12 months.

Entity relations:
- Has_value("life expectancy", "under 12 months")
- OR("malignant tumor", "life expectancy")